Clinical trial exclusion criterion:
Having been diagnosed as HCC within the past 5 years

Entity relations:
- Has_temporal("HCC", "past 5 years")